Clinical trial inclusion criterion:
Clinically stable for at least 1 month prior to entry into the study

Annotated entities:
- Condition: "stable"
- Temporal: "for at least 1 month prior to entry into the study"
- Reference_point: "entry into the study"